5. self-reported failure of at least 2 of the 3 most common treatments for AT (NSAIDS, rest/ice or taping)

The above is a clinical trial inclusion criterion. Annotated with entity spans:
5. [Observation: self-reported] [Condition: failure of at least 2 of the 3 most common treatments for AT] ([Drug: NSAIDS], [Procedure: rest]/[Drug: ice] or [Procedure: taping])